Clinical trial exclusion criterion:
Patients were found to have arrhythmias or obtained QT wave elongation on electrocardiographic

Entity relations:
- AND("electrocardiographic", "QT wave elongation")
- OR("arrhythmias", "electrocardiographic")